Clinical trial exclusion criteria:
1. Patient or relatives unable or unwilling to give informed consent
2. Contraindication or allergy to paracetamol or artesunate therapy
3. Known cirrhosis, or >6 standard alcoholic drinks/day
4. Pregnancy

Annotated entities:
- Parsing_Error: "1."
- Non-query-able: "Patient or relatives unable or unwilling to give informed consent"
- Post-eligibility: "Patient or relatives unable or unwilling to give informed consent"
- Parsing_Error: "2."
- Condition: "Contraindication"
- Condition: "allergy"
- Drug: "paracetamol"
- Drug: "artesunate"
- Parsing_Error: "3."
- Condition: "cirrhosis"
- Condition: ">6 standard alcoholic drinks/day"
- Parsing_Error: "4."
- Condition: "Pregnancy"